Clinical trial inclusion criterion:
HbA1c > 13.0 %

Annotated entities:
- Measurement: "HbA1c"
- Value: "> 13.0 %"